Clinical trial exclusion criteria:
Use of investigational drugs either within 5 half-lives of enrollment, or within 30 days, or until the expected pharmacodynamic effect has returned to baseline, whichever is longer.
Major surgery in the last 3 months prior to baseline or planned major surgery or cardiac intervention during the study.
Cancer or other significant co-morbidities implying that the patient's condition is unstable.
Comorbidities that can be associated with elevated natriuretic peptide (NP) levels: renal insufficiency, (eGFR < 25 ml/min/1.73 m² calculated according to MDRD formula), recent (less than 3 months) cerebral trauma or recent (less than 3 months) cerebrovascular incident, novel diagnosis or acute exacerbation of COPD within the last 3 months.
Patients who are primarily managed and regularly followed-up by a cardiologist for their HF
Highly frail patients whose estimated lifespan due to comorbidities by the judgement of the investigator is less than 6 months.

Annotated entities:
- Non-query-able: "Use of investigational drugs either within 5 half-lives of enrollment, or within 30 days, or until the expected pharmacodynamic effect has returned to baseline, whichever is longer"
- Procedure: "Major surgery"
- Temporal: "last 3 months prior to baseline or planned major surgery or cardiac intervention during the study"
- Reference_point: "baseline or planned major surgery or cardiac intervention during the stud"
- Condition: "Cancer"
- Condition: "co-morbidities"
- Condition: "Comorbidities"
- Measurement: "natriuretic peptide levels"
- Measurement: "NP"
- Value: "elevated"
- Condition: "renal insufficiency"
- Measurement: "eGFR"
- Value: "< 25 ml/min/1.73 m²"
- Condition: "cerebral trauma"
- Temporal: "less than 3 months"
- Condition: "cerebrovascular incident"
- Temporal: "less than 3 months"
- Condition: "acute exacerbation of COPD"
- Temporal: "last 3 months"
- Non-query-able: "Patients who are primarily managed and regularly followed-up by a cardiologist for their HF"
- Observation: "lifespan"
- Temporal: "less than 6 months"